Clinical trial exclusion criteria:
pathological obesity
chronic diseases e.g. cerebral palsy, metabolic disease, etc.
diseases of red blood cells
on medication e.g. steroid, multivitamins, thiamine-containing vitamins, diuretic drugs
hemodialysis or peritoneal dialysis
bariatric surgery

Annotated entities:
- Condition: "pathological obesity"
- Condition: "chronic diseases"
- Condition: "cerebral palsy"
- Condition: "metabolic disease"
- Condition: "diseases of red blood cells"
- Drug: "steroid"
- Drug: "multivitamins"
- Drug: "thiamine-containing vitamins"
- Drug: "diuretic drugs"
- Procedure: "hemodialysis"
- Procedure: "peritoneal dialysis"
- Procedure: "bariatric surgery"